Clinical trial inclusion criterion:
All patients (excluding neonates) requiring one or more allogeneic RBC transfusions for the treatment of anemia will be included.

Entity relations:
- Has_negation("neonates", "excluding")
- Has_qualifier("RBC transfusions", "allogeneic")
- AND("treatment", "anemia")
- AND("RBC transfusions", "treatment")
- Has_multiplier("RBC transfusions", "one or more")
- Has_mood("RBC transfusions", "requiring")